Patients ASA III y IV

The above is a clinical trial exclusion criterion. Annotated with entity spans:
Patients [Measurement: ASA] [Value: III y IV]